關於卵巢上皮癌所用的抗癌藥物中，最常引起手足症候群（hand-foot syndrome），是下列那一種化學藥物製劑？
A. Taxanes
B. Topotecan
C. Liposomal doxorubicin
D. Gemcitabine

正確答案：C. Liposomal doxorubicin